El agente antitumoral cis-platino:
1. Es un complejo cuadrado plano de Pt (II) con 2 moléculas de amoníaco y 2 aniones cloruro situados en cis.
2. Es un complejo cuadrado plano de Pt (IV) con 2 moléculas de amoníaco y 2 aniones cloruro situados en cis.
3. Es un complejo octaédrico de Pt (IV) con 2 moléculas de amoníaco en cis y 4 aniones cloruro en el resto de posiciones.
4. Es un complejo octaédrico de Pt (II) con 2 aniones cloruro en cis y 4 moléculas de amoníaco en el resto de posiciones.
5. Es un alqueno con dos átomos de Pt en las dos posiciones cis respecto al doble enlace.

Respuesta correcta: 1. Es un complejo cuadrado plano de Pt (II) con 2 moléculas de amoníaco y 2 aniones cloruro situados en cis.